美莉產檢時超音波發現，此雙胞胎有兩個羊膜腔，但共用一個胎盤，會有發生雙胞胎間輸血症候群（twin-to-twin transfusion syndrome）的風險，關於雙胞胎間輸血症候群（TTTS），下列敘述何者錯誤？
A. TTTS發生原因目前認為和共用胎盤，且兩個胎兒間的血管相通（vascular anastomosis）造成血流不平衡有關
B. recipient的血液容積增加，會造成羊水過多，嚴重時會有心臟衰竭的現象
C. donor的血液供給recipient，造成donor的血液容積下降，胎兒腎臟灌流（renal 	 perfusion）下降，所以尿量變少，會使羊水過少（oligohydramnios），嚴重時超音波下 donor膀胱會看不到，且常被推擠至一角落（stuck twin）
D. 美莉的兩個雙胞胎間如果體重差異超過30%，就可診斷為TTTS

正確答案：D. 美莉的兩個雙胞胎間如果體重差異超過30%，就可診斷為TTTS